Clinical trial inclusion criterion:
Modified Lanza Score grade 0-1 measured by upper gastrointestinal endoscopy

Annotated entities:
- Measurement: "Modified Lanza Score grade"
- Value: "0-1"
- Procedure: "upper gastrointestinal endoscopy"